BCVA of 24 letters or over

The above is a clinical trial inclusion criterion. Annotated with entity spans:
[Condition: BCVA] of [Qualifier: 24 letters or over]